Has a diagnosis of major depressive disorder by Diagnostic and Statistical Manual of Mental Disorders, Fourth Edition (DSM-IV) criteria.

The above is a clinical trial inclusion criterion. Annotated with entity spans:
Has a diagnosis of [Condition: major depressive disorder] by [Qualifier: Diagnostic and Statistical Manual of Mental Disorders, Fourth Edition (DSM-IV) criteria].